Clinical trial exclusion criterion:
3. History of serious ventricular arrhythmia (i.e., ventricular tachycardia or ventricular fibrillation) or cardiac arrhythmias requiring anti-arrhythmic medications, except for atrial fibrillation that is well controlled with anti-arrhythmic medication.

Entity relations:
- Subsumes("ventricular arrhythmia", "ventricular tachycardia")
- AND("requiring anti-arrhythmic medications", "anti-arrhythmic medications")
- Has_qualifier("cardiac arrhythmias", "requiring anti-arrhythmic medications")
- AND("well controlled with anti-arrhythmic medication", "anti-arrhythmic medication")
- Has_qualifier("atrial fibrillation", "well controlled with anti-arrhythmic medication")
- Has_negation("atrial fibrillation", "except")
- AND("cardiac arrhythmias", "atrial fibrillation")
- Has_qualifier("ventricular arrhythmia", "serious")
- Has_temporal("ventricular arrhythmia", "History")
- Has_temporal("cardiac arrhythmias", "History")
- OR("ventricular tachycardia", "ventricular fibrillation")
- OR("ventricular arrhythmia", "cardiac arrhythmias")